38歲女性病患手術後因四連刺激監測（train of four）顯示肌肉抽動都阻斷（total twitch suppression），並須進住加護病房進行呼吸照護。初步排除其它術後併發症，病人在第2天後逐步恢復，並脫離呼吸器而拔管，病人最可能的診斷為何？
A. spinal cord injury
B. Guillain-Barre syndrome
C. myasthenia gravis
D. meningitis

正確答案：C. myasthenia gravis